Clinical trial exclusion criterion:
Patients with hepatic failure defined as coagulopathy with elevated transaminases more than three times normal values

Entity relations:
- Has_value("transaminases", "elevated more than three times normal values")
- Subsumes("hepatic failure", "coagulopathy")
- AND("coagulopathy", "transaminases")